下列何種先天性心臟病最常聽到的心雜音為連續性（continuous）雜音？
A. 心室中隔缺損
B. 心房中隔缺損
C. 開放性動脈導管
D. 肺動脈狹窄

正確答案：C. 開放性動脈導管